List two human monoclonal antibodies against Clostridium difficile toxins.

Actoxumab and bezlotoxumab are human monoclonal antibodies against C. difficile toxins A and B, respectively. They were shown to decrease Clostridium difficile recurrence. Bezlotoxumab was approved by the Food and Drug Administration and the European Medicines Agency for Clostridium difficile recurrence.